Clinical trial inclusion criterion:
4. Life expectancy > 3 months

Entity relations:
- Has_value("Life expectancy", "> 3 months")